Clinical trial inclusion criterion:
Patients with elective cesarean sections

Entity relations:
- Has_qualifier("cesarean sections", "elective")